Which is the most mutated gene in dilated cardiomyopathy (DCM)?

The LMNA gene is the most mutated gene in dilated cardiomyopathy (DCM) and affects approximately 25% of the patients.